willing to modify antiretroviral therapy, in accordance with the randomisation assignment

The above is a clinical trial inclusion criterion. Annotated with entity spans:
[Observation: willing] to modify [Procedure: antiretroviral therapy], in accordance with the randomisation assignment